下列何種 RNA 病毒可造成胎兒感染及嚴重的先天性畸形發育？
A. 巨細胞病毒（CMV）
B. 德國麻疹病毒（rubella virus）
C. 人類細小病毒（parvovirus）B19
D. 水痘－帶狀疱疹病毒（VZV）

正確答案：B. 德國麻疹病毒（rubella virus）